Clinical trial exclusion criterion:
Pregnant woman or breastfeeding

Entity relations:
- OR("Pregnant", "breastfeeding")